Clinical trial inclusion criterion:
18 to 50 years old

Annotated entities:
- Person: "old"
- Value: "18 to 50 years"